Clinical trial inclusion criterion:
Clinical diagnosis of stable plaque psoriasis with involvement of = 10% body surface area (excluding face and scalp)

Annotated entities:
- Condition: "plaque psoriasis"
- Qualifier: "stable"
- Measurement: "body surface area"
- Negation: "excluding"
- Condition: "face"
- Condition: "scalp"
- Value: "= 10%"
- Grammar_Error: "and"